脂肪酸生合成之速率決定步驟（rate-limiting step）為：
A. 從acetate合成acetyl-CoA
B. acetyl-CoA與malonyl-CoA的縮合反應（condensation）
C. acetyl-CoA carboxylase所催化合成malonyl-CoA的反應步驟
D. 使malonate轉變為malonyl-CoA的反應步驟

正確答案：C. acetyl-CoA carboxylase所催化合成malonyl-CoA的反應步驟